下列有關社區健康評估的敘述，何者錯誤？
A. 為一套解決特定族群健康問題的特定方法
B. 經由發現問題統合可運用的資源擬定解決方案
C. 對所有發現的社區問題，盡一切努力達到問題解決為目標
D. 社區健康評估的目的在增進社區居民的健康狀態

正確答案：C. 對所有發現的社區問題，盡一切努力達到問題解決為目標